Known asthmatic or history of allergy towards peanut or milk products

The above is a clinical trial exclusion criterion. Annotated with entity spans:
Known [Condition: asthmatic] or [Temporal: history] of [Condition: allergy] towards [Drug: peanut] or [Drug: milk products]